El granisetrón posee propiedades antieméticas debido al bloqueo que produce sobre los receptores:
1. Colinérgicos muscarínicos M1.
2. De histamina H1.
3. Dopaminérgicos D2.
4. Serotoninérgicos 5-HT3.

Respuesta correcta: 4. Serotoninérgicos 5-HT3.